女性出現男性素過高症及多毛病，最常見的原因為：
A. 多囊性卵巢症候群
B. 腎上腺腫瘤
C. 卵巢腫瘤
D. 服用男性素

正確答案：A. 多囊性卵巢症候群